Clinical trial inclusion criterion:
5. Capacity to provide consent or assent to participate in research

Annotated entities:
- Non-query-able: "Capacity to provide consent or assent to participate in research"
- Post-eligibility: "Capacity to provide consent or assent to participate in research"